Explain amniotic band syndrome.

Amniotic band syndrome is a rare congenital disorder characterized by the association of bilateral microtia, aplasia or hypoplasia of the collagen fibers of the fascia of the palm, and severe pre- and postnatal growth retardation.